Which viruses are best known to cause myocarditis?

The most frequent viruses causing myocarditis are Enterovirus, Adenovirus and Coxsackie B viruses.